Clinical trial exclusion criterion:
Serious comorbidities preventing prescription of paracetamol

Entity relations:
- AND("preventing", "paracetamol")
- Has_qualifier("comorbidities", "Serious")
- AND("comorbidities", "preventing")